Clinical trial inclusion criterion:
Subject must be able to change to Salbutamol/Albuterol MDI rescue for the duration of the study and judged capable of withholding albuterol/salbutamol for at least 6 hours prior to study visits.

Annotated entities:
- Mood: "able to"
- Procedure: "change"
- Drug: "Salbutamol"
- Drug: "Albuterol"
- Procedure: "MDI rescue"
- Temporal: "for the duration of the study"
- Reference_point: "the duration of the study"
- Condition: "capable of withholding"
- Drug: "albuterol"
- Drug: "salbutamol"
- Multiplier: "for at least 6 hours"
- Temporal: "prior to study visits"